Clinical trial exclusion criterion:
Patients who do not meet the inclusion criteria and those who have a history of allergic reactions to human albumin, as well as those who have received iodinated contrast during the 7 days prior to surgery and pregnant women, will be excluded from the study.

Entity relations:
- Has_negation("meet the inclusion criteria", "not")
- AND("allergic", "human albumin")
- Has_temporal("allergic", "history")
- Has_index("during the 7 days prior to surgery", "surgery")
- multi("surgery", "surgery")
- Has_temporal("iodinated contrast", "during the 7 days prior to surgery")